Clinical trial exclusion criterion:
Unstable patient

Annotated entities:
- Person: "patient"
- Qualifier: "Unstable"